Clinical trial exclusion criterion:
Varus or valgus misalignment exceeding 15°;

Entity relations:
- multi("valgus misalignment", "valgus misalignment")
- multi("Varus misalignment", "Varus misalignment")
- Has_value("Varus misalignment", "exceeding 15°")
- Has_value("valgus misalignment", "exceeding 15°")
- OR("Varus misalignment", "Varus misalignment", "valgus misalignment", "valgus misalignment")